Use of medications associated with steatosis eg. Methotrexate, anticonvulsants, antiretroviral therapy etc.

The above is a clinical trial exclusion criterion. Annotated with entity spans:
Use of [Drug: medications] associated with [Condition: steatosis] eg. [Drug: Methotrexate], [Drug: anticonvulsants], [Drug: antiretroviral therapy] etc.